重度憂鬱症（major depressive disorder）患者的那項特性與往後病程進展為第一型雙極性疾患（bipolar  I disorder）之關聯性較低？
A. 嚴重失眠（insomnia）
B. 精神病症狀
C. 家族病史中有第一型雙極性疾患（bipolar I disorder）
D. 曾因服用抗憂鬱藥物出現輕躁

正確答案：A. 嚴重失眠（insomnia）